Clinical trial inclusion criterion:
ASA I

Annotated entities:
- Measurement: "ASA"
- Value: "I"